關於酒精性肝炎之敘述，何者錯誤？
A. AST通常比ALT高約兩倍以上
B. 典型可見肝臟脂肪堆積，Mallory-Denk bodies，嗜中性白血球（neutrophils）浸潤
C. 纖維化通常由portal areas開始，之後往central vein延伸
D. 酒而言，女性似乎比男性更容易受到肝臟損傷

正確答案：C. 纖維化通常由portal areas開始，之後往central vein延伸